Mujer        de 24 años, asintomática, con antecedentes de padre y hermana afectos de carcinoma medular de tiroides. De forma incidental se descubre en la tomografía computarizada (TC) masa adrenal de 5 cm de diámetro. ¿Cuál de las siguientes opciones debe ser la siguiente decisión clínica?
1. Dado que se halla asintomática se aconseja control semestral con TC seriadas de dicha lesión.
2. Es prioritario la búsqueda de un posible carcinoma medular de tiroides.
3. Debe sospecharse un síndrome de Cushing pre-clínico en el contexto de una neoplasia endocrina múltiple.
4. Deberá practicarse punción-aspiración de dicha lesión para elucidar la naturaleza de dicha lesión.
5. Se deberá determinar catecolaminas en orina para descartar un feocromocitoma.

Respuesta correcta: 5. Se deberá determinar catecolaminas en orina para descartar un feocromocitoma.